¿Cuál de los siguientes tratamientos psicofarmacológicos NO estaría indicado en el tratamiento a largo plazo de una persona con un diagnóstico de trastorno de ansiedad generalizada?
1. Pregabalina.
2. Venlafaxina.
3. Escitalopram.
4. Alprazolam.
5. Duloxetina.

Respuesta correcta: 4. Alprazolam.